Clinical trial exclusion criterion:
Pharmacological intervention (administration of corticosteroids, NSAIDs or paracetamol) or physical intervention (external cooling technique) that may influence temperature in the last 6 hours.

Entity relations:
- multi("Pharmacological intervention", "Pharmacological")
- Subsumes("physical intervention", "external cooling technique")
- AND("Pharmacological intervention", "corticosteroids")
- Has_qualifier("Pharmacological intervention", "that may influence temperature")
- Has_temporal("Pharmacological intervention", "in the last 6 hours")
- multi("that may influence temperature", "temperature")
- OR("corticosteroids", "paracetamol", "NSAIDs")
- OR("Pharmacological intervention", "physical intervention")